Antiemetics or steroids use within 24 hrs prior to surgery

The above is a clinical trial exclusion criterion. Annotated with entity spans:
[Drug: Antiemetics] or [Drug: steroids use] [Temporal: within 24 hrs prior to surgery]